肺結核病灶之組織壞死屬於下列何種類型？
A. 液狀（liquefactive）
B. 凝固狀（coagulative）
C. 乾酪（caseous）
D. 脂肪（fat）

正確答案：C. 乾酪（caseous）